下列何者不屬於全身性發炎反應症候群（systemic inflammatory response syndrome, SIRS）？
A. 核心體溫 < 36℃
B. 心跳 > 90 / min
C. 動脈血二氧化碳分壓（PaCO2）> 32 mmHg
D. 白血球 < 4000 cells / mm3

正確答案：C. 動脈血二氧化碳分壓（PaCO2）> 32 mmHg